Clinical trial exclusion criterion:
Hypersensitivity or contradictions to study drugs

Entity relations:
- AND("Hypersensitivity", "study drugs")
- OR("Hypersensitivity", "contradictions")